Clinical trial exclusion criterion:
Any other variety of LAL

Annotated entities:
- Qualifier: "other variety"
- Condition: "LAL"